Technical possibility to obtain a new tissue biopsy to determine stathmin level in the tumour recurrence.

The above is a clinical trial inclusion criterion. Annotated with entity spans:
[Mood: Technical possibility to obtain] a new [Procedure: tissue biopsy] to determine stathmin level in the [Condition: tumour recurrence].